Clinical trial exclusion criterion:
With a elevated post-void residual (defined as PVR > 100cc)

Annotated entities:
- Measurement: "post-void residual"
- Measurement: "PVR"
- Value: "> 100cc"
- Value: "elevated"